Which translocation is the hallmark of Ewing sarcoma?

The EWS/Fli-1 fusion gene, a product of the translocation t(11;22) (q24;12), is detected in 95% of Ewing sarcoma patients.